Clinical trial inclusion criterion:
signed informed consent form after reading the information about the study and talking with one of the investigators

Annotated entities:
- Informed_consent: "signed informed consent form after reading the information about the study and talking with one of the investigators"